Clinical trial inclusion criterion:
Not planning to change use of medications known to influence appetite or metabolism

Entity relations:
- Has_mood("medications known to influence appetite", "planning to change")
- Has_negation("medications known to influence appetite", "Not")
- OR("medications known to influence appetite", "medications known to influence metabolism")